下列何種藥物，可以用於男性性慾過強之治療？
A. cyproterone
B. clomiphene
C. danazol
D. goserelin

正確答案：A. cyproterone